Clinical trial inclusion criterion:
2. Screening tool: Edinburgh Handedness Inventory.

Annotated entities:
- Parsing_Error: "2."
- Not_a_criteria: "Screening tool: Edinburgh Handedness Inventory."
- Procedure: "Edinburgh Handedness Inventory"